Hemoglobin greater than or equal to 7.5 g/dL

The above is a clinical trial inclusion criterion. Annotated with entity spans:
[Measurement: Hemoglobin] [Value: greater than or equal to 7.5 g/dL]